Clinical trial exclusion criterion:
Unable to adhere to follow up schedule and treatment.

Annotated entities:
- Post-eligibility: "Unable to adhere to follow up schedule and treatment."